Clinical trial exclusion criterion:
Patients with history of allergy to PEG.

Annotated entities:
- Temporal: "history"
- Condition: "allergy"
- Drug: "PEG"